En reacciones consecutivas de primer orden, la constante cinética global:
1. Presenta unidades de concentración-1 tiempo-1.
2. Presenta unidades de tiempo-1.
3. Equivale al cociente de las constantes cinéticas de cada etapa.
4. Corresponde a la suma de las constantes cinéticas de cada etapa.
5. Equivale al producto de las constantes cinéticas de cada etapa.

Respuesta correcta: 2. Presenta unidades de tiempo-1.